下列那一項不是免疫球蛋白 G（immunoglobulin G，IgG）的主要功能？
A. 中和（neutralize）病原菌或其毒素
B. 清除細胞內的病原菌
C. 增進吞噬作用
D. 活化補體功能

正確答案：B. 清除細胞內的病原菌